Clinical trial inclusion criterion:
Left ventricular ejection fraction (LVEF) = 45%

Entity relations:
- Has_value("Left ventricular ejection fraction (LVEF)", "= 45%")